Clinical trial exclusion criterion:
Unexplained abdominal pain

Entity relations:
- Has_qualifier("abdominal pain", "Unexplained")